SCI ( 2 months of injury)

The above is a clinical trial inclusion criterion. Annotated with entity spans:
[Condition: SCI] ( [Temporal: 2 months of injury])